Body mass index > 35

The above is a clinical trial inclusion criterion. Annotated with entity spans:
[Measurement: Body mass index] [Value: > 35]